為深入瞭解醫院內外部處境，醫院管理實務上常使用「SWOT」方法來做策略分析（strategic analysis），這四個	母的"O"是指：
A. opportunity
B. opponent
C. optimum
D. operation

正確答案：A. opportunity